Un biosensor consta de:
1. Un receptor, un transductor, y una marca enzimática.
2. Un receptor y una marca enzimática.
3. Un transductor y una marca enzimática.
4. Un receptor y un transductor.
5. Un receptor y un anticuerpo.

Respuesta correcta: 4. Un receptor y un transductor.